所謂周邊血液幹細胞（peripheral blood stem cell）是指細胞表面具備下列何種抗原之表現者？
A. CD 34
B. CD 30
C. CD 20
D. CD 4

正確答案：A. CD 34